下列有關前列腺特定抗原（PSA）的敘述，何者正確？
A. 是前列腺間質細胞所分泌的醣蛋白
B. 其功能與精液液化有關
C. 其數值不會受到導尿管插入、發炎等因素影響
D. 數值大於 4 ng/mL 即表示癌症

正確答案：B. 其功能與精液液化有關